抗病毒藥物奧斯他偉（oseltamivir），主要是抑制病毒的那一種酵素？
A. 蛋白酶（protease）
B. 神經氨酸酶（neuraminidase）
C. 胸腺嘧啶激酶（thymidine kinase）
D. 反轉錄酶（reverse transcriptase）

正確答案：B. 神經氨酸酶（neuraminidase）